What does polyadenylate-binding protein 4 (PABP4) bind to?

PABP4  binds mRNA poly(A) tails.